針對慢性阻塞性肺病（COPD）所做的吸氣肌肉訓練（inspiratory muscle training），下列那一項敘述錯誤？
A. 會減少橫膈膜（diaphragm）的疲乏
B. 會減少 COPD 急性惡化（acute exacerbation）的發作頻率
C. 會增加 12 分鐘的步行距離（12-MD）
D. 會增加最大吸氣時的嘴壓（maximal inspiratory mouth pressure）

正確答案：B. 會減少 COPD 急性惡化（acute exacerbation）的發作頻率